Clinical trial inclusion criterion:
EDSS score 0.0 to 5.0 (inclusive) at Screening

Entity relations:
- Has_value("EDSS score", "0.0 to 5.0")